Clinical trial inclusion criterion:
Known hypersensitivity to clopidogrel or ticagrelor or any of its components

Entity relations:
- Subsumes("clopidogrel", "any of its components")
- AND("hypersensitivity", "clopidogrel")
- OR("clopidogrel", "ticagrelor")